Clinical trial exclusion criterion:
vulnerable study subjects such as described in Finnish law concerning clinical studies (disabled, children, pregnant or breast-feeding women, prisoners) will not be included.

Annotated entities:
- Condition: "vulnerable"
- Qualifier: "Finnish law concerning clinical studies"
- Condition: "disabled"
- Person: "children"
- Condition: "pregnant"
- Condition: "breast-feeding"
- Person: "women"
- Observation: "prisoners"